Clinical trial inclusion criterion:
KPS score with 50-100 points;

Annotated entities:
- Measurement: "KPS score"
- Value: "50-100 points"